What is the use of Lactin-V?

Lactin-V after treatment with vaginal metronidazole resulted in a significantly lower incidence of recurrence of bacterial vaginosis and can be used for bacterial vaginosis. Lactin-V after treatment for cystitis was associated with a reduction in recurrent UTI.